Clinical trial exclusion criterion:
Treatment of solid malignancy or non-melanoma skin cancer within the past 5 years, or any history of melanoma or hematologic or lymphoproliferative malignancy

Entity relations:
- Has_temporal("solid malignancy", "within the past 5 years")
- OR("solid malignancy", "non-melanoma skin cancer")
- OR("solid malignancy", "hematologic", "lymphoproliferative malignancy", "melanoma")